Clinical trial inclusion criterion:
Age group = 18 ys.

Entity relations:
- Has_value("Age group", "= 18 ys")